Clinical trial exclusion criterion:
Patient subjected to chemical or radiotherapy

Annotated entities:
- Procedure: "radiotherapy"
- Procedure: "chemical"